Clinical trial exclusion criterion:
Uncontrolled ventricular arrhythmia

Entity relations:
- Has_qualifier("ventricular arrhythmia", "Uncontrolled")